Clinical trial inclusion criterion:
aged 3-13 years

Annotated entities:
- Person: "aged"
- Value: "3-13 years"